History of severe mental illness (as their experience of symptoms may already be altered)

The above is a clinical trial exclusion criterion. Annotated with entity spans:
History of [Qualifier: severe] [Condition: mental illness] (as their experience of symptoms may already be altered)